Has Presbyopia or has dependence on spectacles for near work over the contact lenses.

The above is a clinical trial exclusion criterion. Annotated with entity spans:
Has [Condition: Presbyopia] or has [Condition: dependence on spectacles for near work] over the contact lenses.